Clinical trial exclusion criterion:
The use of beta blockers within 2 months of randomization

Entity relations:
- Has_index("within 2 months of randomization", "randomization")
- Has_temporal("beta blockers", "within 2 months of randomization")